Clinical trial exclusion criterion:
Patients who have previous prostate surgery Patients who have muscle invasive bladder cancer

Annotated entities:
- Temporal: "previous"
- Condition: "prostate surgery"
- Line: "Patients who have muscle invasive bladder cancer"
- Line: "Patients who have previous prostate surgery"
- Condition: "bladder cancer"
- Qualifier: "muscle invasive"